Clinical trial exclusion criterion:
Are in renal failure (Creatinine clearance <15 mL/min), have NYHA Functional class IV heart failure, or a systemic illness likely to limit survival to <1 year

Entity relations:
- AND("renal failure", "Creatinine clearance")
- Has_value("Creatinine clearance", "<15 mL/min")
- AND("heart failure", "NYHA Functional class")
- Has_value("NYHA Functional class", "IV")
- Has_context("systemic illness", "survival")
- Has_value("survival", "<1 year")
- OR("renal failure", "heart failure", "systemic illness")